Las bacterias de la especie Haemophilus influenzae:
1. Crecen en el medio de MacConkey.
2. Causa meningitis en niños.
3. Son bacilos Gram positivos anaerobios.
4. Son cocos Gram positivos anaerobios.
5. Son hemolíticas.

Respuesta correcta: 2. Causa meningitis en niños.